Patients who are willing to sign the informed consent form

The above is a clinical trial inclusion criterion. Annotated with entity spans:
[Post-eligibility: Patients who are willing to sign the informed consent form]